Clinical trial exclusion criterion:
history of dementia, psychiatric illness or any diseases of central nervous system.

Annotated entities:
- Condition: "dementia"
- Condition: "psychiatric illness"
- Condition: "diseases of central nervous system"